骨骼肌收縮時tropomyosin發生結構變化，會導致下列何種反應？
A. Ca2+離開troponin後啟動骨骼肌收縮
B. 暴露出actin上的myosin結合位置，使骨骼肌收縮
C. 分解ATP產生能量使actin與myosin結合，並產生滑動
D. tropomyosin與myosin接合，啟動骨骼肌收縮

正確答案：B. 暴露出actin上的myosin結合位置，使骨骼肌收縮